Clinical trial exclusion criterion:
previous OHSS

Entity relations:
- Has_temporal("OHSS", "previous")